4. Expectation of survival for at least 2 months.

The above is a clinical trial inclusion criterion. Annotated with entity spans:
4. [Observation: Expectation] of [Condition: survival] [Temporal: for at least 2 months].